Hypertension

The above is a clinical trial inclusion criterion. Annotated with entity spans:
[Condition: Hypertension]